Clinical trial inclusion criterion:
Nasal septal deviation on exam

Annotated entities:
- Condition: "Nasal septal deviation"